Clinical trial exclusion criterion:
2. History of allergic reactions to TGR-1202 or carfilzomib

Annotated entities:
- Parsing_Error: "2."
- Condition: "allergic reactions"
- Drug: "TGR-1202"
- Drug: "carfilzomib"
- Temporal: "History"